Symptomatic anemia (hemoglobin <10 g/dL) as determined by investigator

The above is a clinical trial inclusion criterion. Annotated with entity spans:
[Qualifier: Symptomatic] [Condition: anemia] ([Measurement: hemoglobin] [Value: <10 g/dL]) as determined by investigator